What is the function of BAX

BAX is a central death regulator that controls apoptosis in normal and cancer cells